Clinical trial inclusion criterion:
received adequate oral and written information about the study and signed an informed-consent form

Annotated entities:
- Informed_consent: "received adequate oral and written information about the study and signed an informed-consent form"